Clinical trial exclusion criterion:
Treatment of solid malignancy or non-melanoma skin cancer within the past 5 years, or any history of melanoma or hematologic or lymphoproliferative malignancy

Annotated entities:
- Condition: "solid malignancy"
- Condition: "non-melanoma skin cancer"
- Temporal: "within the past 5 years"
- Condition: "melanoma"
- Condition: "hematologic"
- Condition: "lymphoproliferative malignancy"